Clinical trial exclusion criterion:
HCC or other malignancy within 3 years.

Entity relations:
- Has_temporal("HCC", "within 3 years")
- OR("HCC", "malignancy")